Clinical trial inclusion criteria:
Male or female >40 and <70 years old.
Has a body mass index >27 and <47 kg/m2.
Not diagnosed with Type 2 diabetes.
Not currently engaged in > 60 min/wk of exercise
Meet at least 3 of 5 National Cholesterol Education Adult Treatment Panel III
Increased waist circumference (=102 cm in men; =88 cm in women)
Elevated triglycerides (=150 mg/dl), or on medication for treating the condition
Reduced HDL-cholesterol (<40mg/dl in men, <50 mg/dl in women), or on medication for treating the condition
High blood pressure (=130 mmHg systolic or =85mmHg diastolic), or on medication for treating the condition
Elevated fasting glucose (=100 mg/dl), or on medication for treating the condition

Annotated entities:
- Person: "Male"
- Person: "female"
- Value: ">40 and <70 years"
- Person: "old"
- Measurement: "body mass index"
- Value: ">27 and <47 kg/m2"
- Negation: "Not"
- Condition: "Type 2 diabetes"
- Negation: "Not"
- Observation: "engaged in exercise"
- Temporal: "currently"
- Value: "> 60 min/wk"
- Value: "at least 3 of 5"
- Measurement: "National Cholesterol Education Adult Treatment Panel III"
- Measurement: "waist circumference"
- Value: "Increased"
- Value: "=102 cm"
- Value: "=88 cm"
- Person: "women"
- Person: "men"
- Measurement: "triglycerides"
- Value: "Elevated"
- Value: "=150 mg/dl"
- Drug: "medication for treating"
- Qualifier: "triglycerides"
- Value: "Reduced"
- Measurement: "HDL-cholesterol"
- Value: "<40mg/dl"
- Value: "<50 mg/dl"
- Person: "women"
- Person: "men"
- Drug: "medication for treating"
- Qualifier: "HDL-cholesterol"
- Value: "High"
- Measurement: "blood pressure"
- Condition: "High blood pressure"
- Value: "=130 mmHg systolic"
- Value: "=85mmHg diastolic"
- Drug: "medication for treating"
- Value: "Elevated"
- Measurement: "fasting glucose"
- Value: "=100 mg/dl"
- Condition: "Elevated fasting glucose"
- Drug: "medication for treating"